Surgery scheduled to last at least 2 hours (including time for anesthesia induction, etc)

The above is a clinical trial inclusion criterion. Annotated with entity spans:
[Procedure: Surgery] [Qualifier: scheduled to last at least 2 hours] ([Non-representable: including time for anesthesia induction, etc])